Clinical trial inclusion criterion:
Culture result consistent with MDR gram negative for this febrile neutropenic episode.

Annotated entities:
- Qualifier: "MDR"
- Condition: "gram negative"